Legally incompetent or mentally impaired (e.g., minors, Alzheimer's subjects, dementia, etc.)

The above is a clinical trial exclusion criterion. Annotated with entity spans:
[Observation: Legally incompetent] or [Condition: mentally impaired] (e.g., [Person: minors], [Condition: Alzheimer's] subjects, [Condition: dementia], etc.)